Clinical trial inclusion criterion:
there is no inoculation history of EV71 vaccine, and there is no history of EV71 infection

Entity relations:
- Has_negation("inoculation", "no")
- AND("inoculation", "EV71 vaccine")
- Has_negation("EV71 infection", "no")
- Has_temporal("EV71 infection", "history")
- Has_temporal("inoculation", "history")